Clinical trial inclusion criteria:
Singleton pregnancy = 37 weeks gestation
Patient presented for induction of labor who is determined to be a candidate for oxytocin
Cephalic presentation
Reassuring fetal health assessment (no abnormal findings in fetal assessment, see below)
Meeting one of the following BMI category:

Annotated entities:
- Condition: "Singleton pregnancy"
- Value: "= 37 weeks"
- Measurement: "gestation"
- Procedure: "induction of labor"
- Mood: "presented for"
- Condition: "candidate for oxytocin"
- Drug: "oxytocin"
- Observation: "Cephalic presentation"
- Value: "Reassuring"
- Measurement: "fetal health assessment"
- Negation: "no"
- Condition: "abnormal findings"
- Procedure: "fetal assessment"